Hombre de 25 años sin antecedentes de interés que acude a urgencias con fiebre, cefalea, mialgias, náuseas, vómitos, dolor abdominal, ictericia e inyección conjuntival, 2 semanas después de haber viajado a Thailandia para participar en una regata en agua dulce. ¿Cuál es el diagnóstico más probable?:
1. Malaria.
2. Esquistosomiasis.
3. Leptospirosis.
4. Rabia.

Respuesta correcta: 3. Leptospirosis.